下列有關羅阿絲蟲（Loa loa）感染人體的敘述，何者錯誤？
A. 成蟲主要寄生在皮下組織
B. 成蟲移行時常會引起劇痛
C. 微絲蟲（microfilaria）會出現在血液內
D. 大多數病患之嗜酸性白血球會明顯增高

正確答案：B. 成蟲移行時常會引起劇痛